Clinical trial inclusion criterion:
The patient has no major impairment of renal or hepatic function, as defined by the following laboratory parameters: total bilirubin <1.5 X ULN; AST, ALT<2.5X ULN (<5 X ULN if liver metastases are present)

Annotated entities:
- Condition: "major impairment of renal function"
- Condition: "major impairment of hepatic function"
- Negation: "no"
- Measurement: "total bilirubin"
- Value: "<1.5 X ULN"
- Measurement: "AST"
- Measurement: "ALT"
- Value: "<2.5X ULN"
- Condition: "liver metastases"
- Value: "<5 X ULN"